Clinical trial inclusion criterion:
BMI = 40 kg/m2.

Entity relations:
- Has_value("BMI", "= 40 kg/m2")